¿Cuál es el único marcador serológico que aparece en personas vacunadas frente al virus de la hepatitis B?:
1. Anti- HBc totales.
2. Anti- HBs.
3. Anti- HBe.
4. Anti- HBc IgM.

Respuesta correcta: 2. Anti- HBs.